Roughly how many base pairs are in the human mitochondrial genome or mtDNA?

The mitochondrial genome, mtDNA, is  16569 base pairs.